Clinical trial exclusion criteria:
Newborn infants <28 weeks and >34 weeks gestation, those with life threatening illness, congenital and chromosomal anomalies, gastrointestinal anomalies or necrotizing enterocolitis and fed premature formula

Annotated entities:
- Person: "Newborn infants"
- Measurement: "gestation"
- Value: "<28 weeks and >34 weeks"
- Condition: "life threatening illness"
- Condition: "chromosomal anomalies"
- Condition: "anomalies congenital"
- Condition: "gastrointestinal anomalies"
- Condition: "necrotizing enterocolitis"
- Observation: "fed premature formula"